Clinical trial exclusion criterion:
The subject has had another active malignancy within the past 5 years except for cervical cancer in situ, in situ carcinoma of the bladder or non-melanoma carcinoma of the skin.

Annotated entities:
- Condition: "active malignancy"
- Temporal: "within the past 5 years"
- Condition: "cervical cancer in situ"
- Negation: "except"
- Condition: "in situ carcinoma of the bladder"
- Condition: "non-melanoma carcinoma of the skin"